ECOG performance status of 0,1, or 2.

The above is a clinical trial inclusion criterion. Annotated with entity spans:
[Measurement: ECOG performance status] of [Value: 0,1], or 2[Value: .]